一位四歲兒童因為誤食治療痢疾的藥丸送到急診處，他已經連續嘔吐 24 小時及排出綠色大便，目前處於嗜睡及皮膚呈現灰色。此藥丸最可能含有下列何種藥物？
A. Clindamycin
B. Chloramphenicol
C. Doxycyclin
D. Erythromycin

正確答案：B. Chloramphenicol